有關 GnRH agonists 藥物之敘述，下列何者最正確？
A. 比內生性 GnRH 半衰期短
B. 給予 3 週後，可刺激 FSH
C. 可治療內膜異位症
D. 可口服使用

正確答案：C. 可治療內膜異位症